Can not obtain the child's parental consent

The above is a clinical trial exclusion criterion. Annotated with entity spans:
[Informed_consent: Can not obtain the child's parental consent]